Clinical trial exclusion criterion:
8. A major surgical procedure, or significant traumatic injury ≤28 days of beginning treatment, or anticipation of the need for major surgery during the course of the study.

Entity relations:
- Has_qualifier("surgical procedure", "major")
- multi("≤28 days of beginning treatment", "beginning treatment")
- Has_qualifier("traumatic injury", "significant")
- Has_temporal("traumatic injury", "≤28 days of beginning treatment")
- Has_mood("major surgery", "need for")
- multi("during the course of the study", "the course of the study")
- Has_temporal("major surgery", "during the course of the study")
- OR("surgical procedure", "traumatic injury", "major surgery")